下列何種鈣離子通道（calcium channel）是所有肌細胞皆具有的，並負責釋出鈣離子啟動收縮？
A. 肌漿網膜上ryanodine receptor
B. 肌細胞膜上ligand-gated Ca2+ channel
C. 肌漿網膜上dihydropyridine receptor
D. 肌細胞膜上L-type Ca2+ channel

正確答案：A. 肌漿網膜上ryanodine receptor